capable of making their own decisions

The above is a clinical trial inclusion criterion. Annotated with entity spans:
[Post-eligibility: capable of making their own decisions]